Clinical trial exclusion criterion:
Donor is sero-positive in HBV/HCV/HIV or RPR.

Annotated entities:
- Condition: "sero-positive in HBV"
- Condition: "sero-positive in HCV"
- Condition: "sero-positive in HIV"
- Condition: "sero-positive in RPR"